Clinical trial exclusion criterion:
malignant tumor;

Annotated entities:
- Condition: "malignant tumor"